La existencia de una asociación estadísticamente significativa entre dos variables ordinales puede determinarse mediante:
1. El test de Kuskal-Wallis.
2. La correlación de Pearson.
3. El test de Kappa.
4. La correlación de Spearman.
5. El test de Wilcoxon.

Respuesta correcta: 4. La correlación de Spearman.